Clinical trial exclusion criterion:
Positive urine drug screening test

Annotated entities:
- Measurement: "urine drug screening test"
- Value: "Positive"